Clinical trial exclusion criterion:
Rheumatic Heart Disease

Annotated entities:
- Condition: "Rheumatic Heart Disease"